Clinical trial inclusion criterion:
The patient agrees to all protocol required follow-up intervals.

Entity relations:
- multi("agrees to all protocol required follow-up intervals", "follow-up intervals")